serious diseases

The above is a clinical trial exclusion criterion. Annotated with entity spans:
[Qualifier: serious] [Condition: diseases]